Es una función de los peroxisomas:
1. Oxidación de los ácidos grasos.
2. Oxidación de proteínas.
3. Síntesis de catalasa.
4. Oxidación de ácidos biliares.

Respuesta correcta: 1. Oxidación de los ácidos grasos.